Ability and willingness of participant or a legally authorized representative (see protocol for more information) to provide informed consent

The above is a clinical trial inclusion criterion. Annotated with entity spans:
[Post-eligibility: Ability and willingness of participant or a legally authorized representative (see protocol for more information) to provide informed consent]